Clinical trial exclusion criterion:
Any history of meningococcal vaccination or meningococcal and gonorrhoea diseases.

Annotated entities:
- Drug: "meningococcal vaccination"
- Temporal: "history"
- Condition: "meningococcal diseases"
- Condition: "gonorrhoea diseases"